Clinical trial inclusion criteria:
Male and female patients, age 18-75 yrs.
COPD diagnosed according to GOLD, FEV1 40-80% predicted, SpO2 =92% at 750 m.
Born, raised and currently living at low altitude (<800m).
Written informed consent.

Annotated entities:
- Person: "Male"
- Person: "female"
- Person: "age"
- Value: "18-75 yrs"
- Condition: "COPD"
- Measurement: "GOLD"
- Measurement: "FEV1"
- Value: "40-80% predicted"
- Measurement: "SpO2"
- Value: "=92% at 750 m"
- Non-query-able: "Born, raised and currently living at low altitude (<800m)"
- Post-eligibility: "Written informed consent"